Clinical trial inclusion criterion:
The subject agrees to comply with study protocol requirements and all follow up visit requirements.

Annotated entities:
- Informed_consent: "The subject agrees to comply with study protocol requirements and all follow up visit requirements"